當醫師判斷一個病人的預後極差而死亡終究無法避免時，下列何種處置最不正確？
A. 在向病人解說前，醫師應思考該告訴病人及家屬什麼內容
B. 醫師應立即將所有的相關病情告知病人，以免日後引發醫療糾紛
C. 醫師應思考該用什麼方法來延續病人的生命及維持其生活品質
D. 在向病人解說後，醫師應讓病人有足夠的時間與醫師交談及提問

正確答案：B. 醫師應立即將所有的相關病情告知病人，以免日後引發醫療糾紛